Cr(creatinine) >1.5×ULN.

The above is a clinical trial inclusion criterion. Annotated with entity spans:
[Measurement: Cr]([Measurement: creatinine]) [Value: >1.5×ULN].